breast cancer ( DIN 2 e 3, o LIN 2 e 3 sec. Tavassoli) scheduled for nipple-sparing mastectomy, simple mastectomy, skin-sparing mastectomy, skin-reducing mastectomy c, lymphnode biopsy and axillary dissection;

The above is a clinical trial inclusion criterion. Annotated with entity spans:
[Condition: breast cancer] ( [Measurement: DIN] [Value: 2 e 3], o [Measurement: LIN] [Value: 2 e 3 sec]. Tavassoli) [Mood: scheduled for] [Condition: nipple-sparing mastectomy], [Condition: simple mastectomy], [Condition: skin-sparing mastectomy], [Condition: skin-reducing mastectomy] c, [Condition: lymphnode biopsy] and [Condition: axillary dissection];